一位婦女因為疲累應診，理學檢查顯示臉色發黃，眼白呈現黃疸，血液檢查顯示全膽紅素（total bilirubin）為 4.2 mg/dL，直接膽紅素為 0.8 mg/dL, AST（GOT）105 U/L（正常<31），ALT（GPT） 30 U/L（正常<31），小便檢查顯示顏色為黃色，膽紅素陰性。則下列何項檢查對進一步診斷最無幫助？
A. B 型肝炎抗原（HBsAg）
B. 乳酸去氫（LDH）
C. 全血球計數（CBC）
D. 網狀紅血球（reticulocyte）

正確答案：A. B 型肝炎抗原（HBsAg）